Clinical trial exclusion criterion:
Known or suspected non-compliance, drug or alcohol abuse

Entity relations:
- Has_qualifier("drug abuse", "non-compliance")
- OR("drug abuse", "alcohol abuse")